El valor de utilidad correspondiente a un estado de salud, que se puede utilizar después en un estudio de coste-utilidad, generalmente tiene un valor:
1. Entre 0 y 1.
2. Entre 0 y 10.
3. Entre 0 y 100.
4. Entre -10 y +10.
5. Entre -100 y + 100.

Respuesta correcta: 1. Entre 0 y 1.